Other respiratory disorders: Subjects with active tuberculosis, lung cancer, bronchiectasis, sarcoidosis, pulmonary fibrosis, pulmonary hypertension, interstitial lung diseases or other active pulmonary diseases.

The above is a clinical trial exclusion criterion. Annotated with entity spans:
[Condition: Other respiratory disorders]: Subjects with active [Condition: tuberculosis], [Condition: lung cancer], [Condition: bronchiectasis], [Condition: sarcoidosis], [Condition: pulmonary fibrosis], [Condition: pulmonary hypertension], [Condition: interstitial lung diseases] or other [Condition: active pulmonary diseases].